diagnosed advanced heart, kidney or liver failure

The above is a clinical trial exclusion criterion. Annotated with entity spans:
diagnosed [Condition: advanced heart], [Condition: kidney] or [Condition: liver] failure